Clinical trial inclusion criteria:
Unilateral leg pain secondary to lateral stenosis, disc protrusion or herniated disc.
Age between 18 and 80 years.
Moderate to severe pain (NVS>4).
Right proficient oral and written language.

Annotated entities:
- Condition: "Unilateral leg pain"
- Condition: "lateral stenosis"
- Condition: "disc protrusion"
- Condition: "herniated disc"
- Person: "Age"
- Value: "between 18 and 80 years"
- Condition: "pain"
- Measurement: "NVS"
- Value: ">4)"
- Qualifier: "severe"
- Qualifier: "Moderate"
- Post-eligibility: "Right proficient oral and written language"